關於慮病症（hypochondriasis）的敘述，何者正確？
A. 低社經階層之患者預後較佳
B. 個案治療後改善率極佳，90%以上能痊癒
C. 常伴隨憂鬱或焦慮相關疾患
D. 病程較少超過6個月

正確答案：C. 常伴隨憂鬱或焦慮相關疾患